王先生因為持續性腹痛而至醫院急診處就診，根據他的描述，剛開始腹痛是在肚臍周圍，幾小時後症狀加劇且腹痛位置變成右下腹，王先生之後接受手術治療，證實是急性闌尾炎。則這種型態的腹痛應為下列何者？
A. 投射性疼痛（referred pain）
B. 由臟器性疼痛（visceral pain）轉變為腹壁性疼痛（parietal pain）
C. 由腹壁性疼痛（parietal pain）轉變成臟器性疼痛（visceral pain）
D. 慢性疼痛（chronic pain）

正確答案：B. 由臟器性疼痛（visceral pain）轉變為腹壁性疼痛（parietal pain）